Clinical trial exclusion criterion:
Hypersensitivity to apomorphine or one of the excipients

Annotated entities:
- Condition: "Hypersensitivity"
- Drug: "apomorphine"
- Drug: "excipients"